Patients with uncontrolled hypertension

The above is a clinical trial exclusion criterion. Annotated with entity spans:
Patients with [Condition: uncontrolled hypertension]